用力呼氣（forced expiration）時，最不易發生下列何種現象？
A. 肋膜內壓（intrapleural pressure, Pip）不會高於大氣壓力（atmospheric pressure, Patm）
B. 內肋間神經（internal intercostal nerve）興奮
C. 延髓（medulla oblongata）內有些腹側呼吸群神經元（ventral respiratory group neuron）興奮
D. 無論如何用力，部分細支氣管（bronchiole）內的氣體無法被呼出

正確答案：A. 肋膜內壓（intrapleural pressure, Pip）不會高於大氣壓力（atmospheric pressure, Patm）